含嗜中性白血球及壞死組織之滲出物，屬於何種炎症？
A. 漿液性
B. 出血性
C. 肉芽性
D. 化膿性

正確答案：D. 化膿性